下列那個補體系統的成分會在典型和替代途徑都扮演重要的角色？
A. C1
B. C2
C. C3
D. C4

正確答案：C. C3